Clinical trial inclusion criterion:
Patients may have received 1-3 prior systemic therapies in the metastatic setting.

Annotated entities:
- Multiplier: "1-3"
- Temporal: "prior"
- Procedure: "systemic therapies"
- Qualifier: "metastatic setting"